Clinical trial exclusion criterion:
Previous treatment with romiplostim or eltrombopag

Entity relations:
- OR("romiplostim", "eltrombopag")